Positive serology for C hepatitis in the screening evaluation;

The above is a clinical trial exclusion criterion. Annotated with entity spans:
[Value: Positive] [Measurement: serology for C hepatitis] [Temporal: in the screening evaluation];